Clinical trial inclusion criteria:
Good general health
Older than the age of legal consent (i.e. 18 years old)
Sonographic diagnosis of ovarian endometrioma with diameter at least 4cm on 2 separate scans at least 6 weeks apart
No contraindication to use of progesterone or combined oral contraceptive pills
Not attempting to conceive either at the time of study entry or for at least 2 years after surgery
Willing and able to participate after the study has been explained

Annotated entities:
- Condition: "Good general health"
- Value: "Older than the age of legal consent"
- Person: "age"
- Value: "18 years old"
- Procedure: "Sonographic"
- Condition: "ovarian endometrioma"
- Qualifier: "diameter at least 4cm"
- Multiplier: "2 separate scans"
- Temporal: "at least 6 weeks apart"
- Negation: "No"
- Condition: "contraindication"
- Drug: "progesterone"
- Drug: "combined oral contraceptive pills"
- Mood: "attempting"
- Procedure: "conceive"
- Temporal: "at the time of study entry"
- Temporal: "for at least 2 years after surgery"
- Negation: "Not"
- Non-query-able: "Willing and able to participate after the study has been explained"